-Patients residing in the following clinical states wit! be considered: A. Rising PSA: Patients with a history of localized disease who have undergone definitive radiation or surgery. These patients must demonstrate progression of disease biochemically as outlined below. Patients in this group may not have radiographically evident disease.

The above is a clinical trial inclusion criterion. Annotated with entity spans:
[Parsing_Error: -Patients residing in the following clinical states wit!] [Parsing_Error: be considered: A.] [Value: Rising] [Measurement: PSA]: Patients with a [Temporal: history of] [Condition: localized disease] who have undergone [Qualifier: definitive] [Procedure: radiation] or [Procedure: surgery]. These patients must demonstrate [Observation: progression of disease] [Qualifier: biochemically] as outlined below. Patients in this group may not have [Qualifier: radiographically evident] [Condition: disease].